Name curated data resources for ChIP-seq data

The MGA repository, Cistrome Data Browser and CR Cistrome are curated data resources for ChIP-seq data.